下列有關典型 febrile convulsion 的敘述，何者錯誤？
A. 常發生在發展正常的嬰幼兒
B. 病兒日後產生癲癇的機率比正常人口發生率高五倍
C. 重複發作的病兒不一定須長期服用癲癇藥物
D. 發作時間常是小於五分鐘

正確答案：B. 病兒日後產生癲癇的機率比正常人口發生率高五倍